Clinical trial exclusion criterion:
Any history of anorexia or bulimia within 2 years before Screening, Attention Deficit Hyperactivity Disorder, any Diagnostic and Statistical Manual of Mental Disorders, 5th Edition depressive disorder, bipolar disorder, or schizophrenia

Entity relations:
- Has_index("within 2 years before Screening", "Screening")
- Has_temporal("anorexia", "within 2 years before Screening")
- Has_temporal("anorexia", "history")
- Has_qualifier("depressive disorder", "Diagnostic and Statistical Manual of Mental Disorders, 5th Edition")
- OR("anorexia", "bulimia")
- OR("depressive disorder", "schizophrenia", "bipolar disorder")
- OR("anorexia", "Attention Deficit Hyperactivity Disorder", "depressive disorder")